Clinical trial exclusion criterion:
Albumin < 3g/dl or platelet count < 75 x 103/mL

Annotated entities:
- Measurement: "Albumin"
- Value: "< 3g/dl"
- Measurement: "platelet count"
- Value: "< 75 x 103/mL"